有關弗克斯氏內皮失養症（Fuchs endothelial dystrophy）的敘述，下列何者錯誤？
A. 是角膜移植的常見原因
B. 角膜基質水腫
C. 水泡形角膜病變（bullous keratopathy）
D. Guttata是角膜Bowman層不正常的物質沉

正確答案：D. Guttata是角膜Bowman層不正常的物質沉